Weight <45kg

The above is a clinical trial exclusion criterion. Annotated with entity spans:
[Measurement: Weight] [Value: <45kg]